Clinical trial exclusion criterion:
Previous enrolment in the present study or participation in another clinical study with an investigational product during the last 3 months or as judged by the Investigator.

Annotated entities:
- Competing_trial: "Previous enrolment in the present study or participation in another clinical study with an investigational product during the last 3 months or as judged by the Investigator."